Clinical trial exclusion criterion:
Use of anticoagulation therapy

Annotated entities:
- Procedure: "anticoagulation therapy"
- Drug: "anticoagulation"